有關非上皮性卵巢癌的病理敘述如下：The large round, ovoid, or polygonal cell have abundant, clear, vary-palestaining cytoplasm, large and irregular nuclei, and prominent nucleoli，為那種腫瘤的診斷？
A. 卵巢支持間質細胞瘤（Sertoli-Leydig cell tumor）
B. 無性胚胎瘤（dysgerminoma）
C. 成人型卵巢顆粒性細胞瘤（adult-type granulosa cell tumor）
D. 卵巢內胚層竇瘤（endodermal sinus tumor）

正確答案：B. 無性胚胎瘤（dysgerminoma）